Parents who agree to complete documentation and follow up at 14 days post-operation.

The above is a clinical trial inclusion criterion. Annotated with entity spans:
[Informed_consent: Parents who agree to complete documentation and follow up at 14 days post-operation.]